Clinical trial inclusion criterion:
menstrual disorder,

Annotated entities:
- Condition: "menstrual disorder"